El espectro infrarrojo del clorhidrato de procaína muestra una banda intensa cerca de 1700 cm-1. ¿Qué información proporciona este dato sobre su estructura?
1. Tiene un anillo aromático.
2. Tiene un grupo carbonilo.
3. Se trata de una amina terciaria.
4. Es una amina aromática.
5. Es una sal.

Respuesta correcta: 2. Tiene un grupo carbonilo.